Clinical trial exclusion criterion:
Personal history of Guillain-Barré Syndrome.

Annotated entities:
- Condition: "Guillain-Barré Syndrome"
- Temporal: "history"